Intra-uterine pregnancy

The above is a clinical trial inclusion criterion. Annotated with entity spans:
[Condition: Intra-uterine pregnancy]